Clinical trial inclusion criterion:
Good symptom control

Entity relations:
- Has_qualifier("symptom control", "Good")